胎盤的絨毛間隙（intervillous space）內含有：
A. 母體血液
B. 胎兒血液
C. 胎兒血漿及母體血液
D. 胎兒血液及母體血漿

正確答案：A. 母體血液